Clinical trial exclusion criterion:
history or evidence of administration of immunoglobulins and/or any blood products during the study period or within the three months preceding the study vaccine

Entity relations:
- Has_index("during the study period", "study period")
- Has_index("within the three months preceding the study vaccine", "study vaccine")
- Has_temporal("immunoglobulins", "during the study period")
- OR("during the study period", "within the three months preceding the study vaccine")
- OR("immunoglobulins", "blood products")